Women with history of previous thromboembolic disorders

The above is a clinical trial exclusion criterion. Annotated with entity spans:
[Person: Women] with [Temporal: history] of [Temporal: previous] [Condition: thromboembolic disorders]